Patient is at least 18 at the day of screening.

The above is a clinical trial inclusion criterion. Annotated with entity spans:
Patient is [Temporal: at least 18 at the day of screening].